Clinical trial exclusion criterion:
Subjects were not to have participated in a previous clinical trial within 90 days prior to study initiation.

Entity relations:
- Has_temporal("participated in a previous clinical trial", "90 days prior to study initiation")